Any liver disease in recipient

The above is a clinical trial exclusion criterion. Annotated with entity spans:
Any [Condition: liver disease] in recipient